Total bilirubin >= 2 x ULN

The above is a clinical trial exclusion criterion. Annotated with entity spans:
[Measurement: Total bilirubin] [Value: >= 2 x ULN]